關於類天疱瘡（bullous pemphigoid）的敘述，下列何者錯誤？
A. 常發生於年輕人
B. 初期可以搔癢、蕁麻疹樣的病灶表現
C. 病灶的病理組織檢查常見嗜伊紅球（eosinophil）浸潤
D. 治療藥物以口服皮質類固醇和免疫抑制劑為主

正確答案：A. 常發生於年輕人